Contraindications to placement of a Foley catheter in the bladder.

The above is a clinical trial exclusion criterion. Annotated with entity spans:
[Condition: Contraindications] to [Procedure: placement of a Foley catheter] in the [Qualifier: bladder].